Eastern Cooperative Oncology Group score 0-2

The above is a clinical trial inclusion criterion. Annotated with entity spans:
[Measurement: Eastern Cooperative Oncology Group] [Value: score 0-2]